Diagnosis of epilepsy confirmed.

The above is a clinical trial inclusion criterion. Annotated with entity spans:
Diagnosis of [Condition: epilepsy] confirmed.